Clinical trial inclusion criterion:
Subjects undergoing treatment for type 2 diabetes

Entity relations:
- AND("treatment", "type 2 diabetes")